gravidity,

The above is a clinical trial exclusion criterion. Annotated with entity spans:
[Condition: gravidity],